Patients with hepatic failure defined as coagulopathy with elevated transaminases more than three times normal values

The above is a clinical trial exclusion criterion. Annotated with entity spans:
Patients with [Condition: hepatic failure] defined as [Condition: coagulopathy] with [Value: elevated] [Measurement: transaminases] more than three times normal values